Clinical trial exclusion criterion:
Current severe, uncontrolled systemic disease (eg, clinically significant cardiovascular, pulmonary, or metabolic disease; wound healing disorders; ulcers; or bone fractures).

Annotated entities:
- Qualifier: "severe"
- Qualifier: "uncontrolled"
- Condition: "systemic disease"
- Qualifier: "clinically significant"
- Condition: "pulmonary disease"
- Condition: "metabolic disease"
- Condition: "cardiovascular disease"
- Condition: "wound healing disorders"
- Condition: "ulcers"
- Condition: "bone fractures"